HIV infected

The above is a clinical trial exclusion criterion. Annotated with entity spans:
[Condition: HIV infected]